Clinical trial exclusion criterion:
eGFR <45

Entity relations:
- Has_value("eGFR", "<45")